Spinal anesthesia or sciatic nerve block contraindicated

The above is a clinical trial exclusion criterion. Annotated with entity spans:
[Procedure: Spinal anesthesia] or [Procedure: sciatic nerve block] [Condition: contraindicated]